對血清素（serotonin）的敘述，下列何者正確？
A. 大腦和腸道分泌大多為不同之亞型（subtype）
B. 消化道分泌量約占全身產量的90%
C. 由胱胺酸（cystine）所合成
D. 主要由胃的 parietal cells 所分泌

正確答案：B. 消化道分泌量約占全身產量的90%